Clinical trial exclusion criterion:
Chronic kidney disease stage 5 (GFR < 15 ml/min)

Annotated entities:
- Condition: "Chronic kidney disease"
- Qualifier: "stage 5"
- Measurement: "GFR"
- Value: "< 15 ml/min)"